What is the administration route of IVIG in Alzheimer's disease patients?

IVIG is administered intravenously.